Clinical trial exclusion criterion:
Transplanted patients or patients suffering from severe auto-immune disease.

Entity relations:
- OR("Transplanted", "severe auto-immune disease")